Clinical trial inclusion criterion:
Laboratory urine culture: <103 CFUs

Annotated entities:
- Measurement: "Laboratory urine culture"
- Value: "<103 CFUs"